有關基底細胞癌（basal cell carcinoma）之敘述，下列何者錯誤？
A. 是最常見之皮膚惡性腫瘤
B. 與曝曬陽光有關
C. 有時會侵犯深部組織
D. 常會轉移（metastasis）

正確答案：D. 常會轉移（metastasis）